Ascites

The above is a clinical trial exclusion criterion. Annotated with entity spans:
[Condition: Ascites]